Clinical trial exclusion criterion:
atrial fibrillation/flutter with a mean ventricular response rate at rest >100 beats per minute

Annotated entities:
- Condition: "atrial fibrillation"
- Condition: "atrial flutter"
- Measurement: "mean ventricular response rate"
- Qualifier: "at rest"
- Value: ">100 beats per minute"